If taking cognitive enhancers (donepezil, rivastigmine, memantine, galantamine), must be on stable dose at least 30 days prior to screening, and be expected to remain on a stable dose for the duration of the study.

The above is a clinical trial inclusion criterion. Annotated with entity spans:
If taking [Procedure: cognitive enhancers] ([Drug: donepezil], [Drug: rivastigmine], [Drug: memantine], [Drug: galantamine]), must be on [Qualifier: stable dose] [Temporal: at least 30 days prior to screening], and be expected to remain on a stable dose for the duration of the study.